What tissue is commonly affected in Marfan's syndrome

Marfan syndrome (MS) is a connective tissue disorder that affects thousands of adolescents.